Clinical trial inclusion criteria:
Major spine surgery scheduled as part of clinical care
18-80 years

Annotated entities:
- Procedure: "Major spine surgery"
- Person: "years"
- Value: "18-80"